Clinical trial inclusion criterion:
Any therapy by intra-articular injections (e.g. corticosteroid) within 4 weeks before baseline

Entity relations:
- AND("intra-articular injections", "corticosteroid")
- Has_temporal("intra-articular injections", "within 4 weeks before baseline")